Which are the types of cancer that c-Myc is associated with?

c-Myc is known to be deregulated in a variety of tumors, including breast cancer, prostate cancer, non-small cell lung cancer (NSCLC), papillary thyroid cancer (PDA), ovarian cancer, cervical intraepithelial neoplasia, and gastric cancer.